Clinical trial inclusion criterion:
a crown-rump length <6mm and no fetal growth at least one week later OR

Entity relations:
- Has_negation("fetal growth", "no")
- Has_value("crown-rump length", "<6mm")
- Has_temporal("crown-rump length", "at least one week later")
- Has_temporal("crown-rump length")
- Has_temporal("fetal growth", "at least one week later")
- Has_temporal("fetal growth")
- OR("at least one week later")
- OR("crown-rump length")
- OR("fetal growth")